Clinical trial inclusion criterion:
subarachnoid anaesthesia

Annotated entities:
- Procedure: "subarachnoid anaesthesia"